Gastrointestinal disorders;

The above is a clinical trial exclusion criterion. Annotated with entity spans:
[Condition: Gastrointestinal disorders];